有關頸部交感神經幹（sympathetic trunk）之敘述，下列何者正確？
A. 頸部交感神經幹無灰交通枝（gray rami communicantes）
B. 下頸神經節與第一胸神經節（first thoracic ganglion）經常合併而成星狀神經節（stellate ganglion）
C. 上頸神經節會發出灰交通枝（gray rami communicantes）至第五、六頸脊神經（cervical spinal nerves）
D. 中頸神經節不發出心神經（cardiac nerves）

正確答案：B. 下頸神經節與第一胸神經節（first thoracic ganglion）經常合併而成星狀神經節（stellate ganglion）